Clinical trial exclusion criterion:
Severe liver or renal disease.

Annotated entities:
- Condition: "renal disease"
- Condition: "disease liver"
- Qualifier: "Severe"